Clinical trial inclusion criterion:
Patients undergoing thoracic aorta surgery with hypothermic circulatory arrest, over 20-of age

Entity relations:
- Has_qualifier("surgery", "thoracic aorta")
- Has_value("age", "over 20")
- AND("surgery", "hypothermic circulatory arrest")